Mujer de 35 años de edad en tratamiento hormonal por infertilidad. Acude a Urgencias por síndrome constitucional y parestesias en hemicuerpo izquierdo. En análisis de sangre se detecta: Hb 7.5 gr/dL, reticulocitos 10% (0.52%), plaquetas 5.000/uL, leucocitos normales, LDH 1.200 UI/L, test de Coombs directo negativo, haptoglobina indetectable. Morfología de    sangre     periférica  con     abundantes esquistocitos. Pruebas de coagulación normales. ¿Cuál es la sospecha diagnóstica y el tratamiento más adecuado?
1. Anemia hemolítica autoinmune. Iniciar esteroides.
2. Enfermedad        de     von     Willebrand. Administración de desmopresina.
3. Púrpura trombocitopénica. Iniciar esteroides y transfusión de plaquetas.
4. Síndrome de Evans. Iniciar esteroides.
5. Púrpura      trombótica     trombocitopénica. Tratamiento con plasmaféresis.

Respuesta correcta: 5. Púrpura      trombótica     trombocitopénica. Tratamiento con plasmaféresis.